Una técnica de gran relevancia en adicciones para motivar al paciente a realizar el tratamiento es:
1. La motivación catártica.
2. El control estimular.
3. La entrevista motivacional.
4. La intención paradójica.

Respuesta correcta: 3. La entrevista motivacional.